Uncontrolled Diabetes [hemoglobin A1c, (HbA1c) >7.5%].

The above is a clinical trial exclusion criterion. Annotated with entity spans:
[Qualifier: Uncontrolled] [Condition: Diabetes] [[Measurement: hemoglobin A1c], ([Measurement: HbA1c]) [Value: >7.5%]].